Clinical trial exclusion criterion:
failure to gain consent of parents.

Entity relations:
- Has_negation("consent of parents", "failure to gain")